Clinical trial inclusion criterion:
Previous treatment with any cell-depleting therapies

Annotated entities:
- Procedure: "cell-depleting therapies"
- Temporal: "Previous"